Clinical trial exclusion criterion:
Clinically significant new illness within 1 month before randomization that may affect the participant's ability to fulfill the study requirements or significantly confound the assessments

Entity relations:
- Has_qualifier("illness", "new")
- Has_qualifier("illness", "Clinically significant")
- Has_index("within 1 month before randomization", "randomization")
- Has_temporal("illness", "within 1 month before randomization")
- Has_context("illness", "may affect the participant's ability to fulfill the study requirements")
- OR("may affect the participant's ability to fulfill the study requirements", "significantly confound the assessments may")